下列引起兒童泌尿道感染（urinary tract infection）的細菌，何者最為罕見？
A. Streptococcus spp.
B. Escherichia coli
C. Klebsiella spp.
D. Proteus spp.

正確答案：A. Streptococcus spp.